What causes Black Lung?

Black lung, also known as pneumoconiosis, is caused by chronic exposure to coal dust.